高先生的太太觀察到高先生半夜起來走出房門，甚至打開冰箱取用食物，家人呼喊也未能叫醒，隔天清晨高先生對於這些事情沒有印象，這種情形發生在睡眠的那一期？
A. 非快速動眼期的第一期（non-REM, stage I）
B. 非快速動眼期的第二期（non-REM, stage II）
C. 非快速動眼期的第三、四期（non-REM, stages III & IV）
D. 快速動眼期（REM）

正確答案：C. 非快速動眼期的第三、四期（non-REM, stages III & IV）